Any patients contraindicated for vaginal delivery

The above is a clinical trial exclusion criterion. Annotated with entity spans:
Any patients [Condition: contraindicated] for [Procedure: vaginal delivery]